改變行為的過程可以分成嘗試（想要改變）、承諾（決心改變）、行動（力行改變）和持續（堅強改變）四個階段。新建立的行為若無法堅持，致使舊行為再度出現，這個現象通常稱為什麼？
A. 改變
B. 復發
C. 修飾
D. 強化

正確答案：B. 復發